Which enzyme deficiency can cause GM1 gangliosidoses?

GM1 gangliosidoses are associated with deficiency of β-galactosidase.